Clinical trial exclusion criterion:
• Live vaccinations (3 months off drug)

Annotated entities:
- Drug: "Live vaccinations"
- Temporal: "3 months off drug"